Clinical trial exclusion criteria:
Sensitization (i.e. PRA >20%)
Any liver disease in recipient
Albumin < 3g/dl or platelet count < 75 x 103/mL
Need for dual organ transplant

Annotated entities:
- Condition: "Sensitization"
- Measurement: "PRA"
- Value: ">20%"
- Condition: "liver disease"
- Measurement: "Albumin"
- Value: "< 3g/dl"
- Measurement: "platelet count"
- Value: "< 75 x 103/mL"
- Measurement: "dual organ transplant"
- Mood: "Need for"